胃幽門完全阻塞會引起嚴重嘔吐，若未妥善治療，容易導致下列何種結果？
A. 腹水快速增加
B. 酸中毒
C. 鹼中毒
D. 脫水，但無明顯酸鹼失衡

正確答案：C. 鹼中毒